Paciente de 74 años de edad, asintomático, que en una analítica de rutina presenta plaquetas 40.000 plaquetas/µL, siendo el resto del hemograma normal y la bioquímica completa normal. Señale la respuesta correcta:
1. El diagnóstico más probable es una Púrpura Trombocitopénica Idiopática y se debe iniciar tratamiento esteroideo lo antes posible.
2. Se trata de una trombopenia grave con alto riesgo de sangrados espontáneos.
3. Se debería realizar un frotis de sangre periférica      para        descartar       una pseudotrombocitopenia        o    trombopenia espúrea antes de realizar medidas adicionales.
4. El diagnóstico más probable es el de un síndrome mielodisplásico, por lo que la prueba inicial a realizar sería un estudio de médula ósea.
5. Se debe realizar un estudio inicial con serologías virales, estudio de autoinmunidad y ecografia abdominal. Si todas estas pruebas fueran normales se debería completar el estudio con un frotis de sangre periférica.

Respuesta correcta: 3. Se debería realizar un frotis de sangre periférica      para        descartar       una pseudotrombocitopenia        o    trombopenia espúrea antes de realizar medidas adicionales.